有關腎臟移植術後照顧，下列敘述何者錯誤？
A. 手術後二天仍沒有或很少小便出來就是急性排斥產生了
B. 術後若有大量小便出來，要維持足夠水分，並注意鉀離子是否低下
C. 腎臟移植術後，可能會出現腎小管壞死現象
D. Doppler ultrasound 對於血管栓塞或輸尿管阻塞問題而言，是一極方便的檢查

正確答案：A. 手術後二天仍沒有或很少小便出來就是急性排斥產生了